一名兒童，因慢性腹瀉、脹氣、脂肪便、吸收不良等症狀就醫，在其糞便檢出具有兩個細胞核的營養體，他最可能感染的寄生蟲是：
A. 雙核阿米巴（Dientamoeba fragilis）
B. 梨形鞭毛蟲（Giardia lamblia）
C. 大腸纖毛蟲（Balantiduim coli）
D. 人滴蟲（Trichomonas hominis）

正確答案：B. 梨形鞭毛蟲（Giardia lamblia）